Clinical trial exclusion criterion:
Immune suppressive treatment within the previous 6 months

Entity relations:
- Has_temporal("Immune suppressive treatment", "within the previous 6 months")